Clinical trial inclusion criterion:
Platelets >= 100,000/ul

Entity relations:
- Has_value("Platelets", ">= 100,000/ul")